All patients must have diagnostic laparoscopy with diagnostic washings for cytology; both cytology positive and negative patients are eligible for enrolment, but only cytology negative patients will be included in the primary analyses; gross peritoneal disease is not eligible

The above is a clinical trial inclusion criterion. Annotated with entity spans:
All patients must have [Qualifier: diagnostic] [Procedure: laparoscopy] with diagnostic [Procedure: washings for cytology]; both [Measurement: cytology] [Value: positive] and [Value: negative] patients are eligible for enrolment, but o[Non-query-able: nly cytology negative patients will be included in the primary analyses; gross peritoneal disease is not eligible]